Clinical trial exclusion criterion:
History of allergic or hypersensitivity reaction to ascorbic acid products

Annotated entities:
- Condition: "allergic"
- Condition: "hypersensitivity"
- Drug: "ascorbic acid"